Clinical trial inclusion criterion:
Patients who have received no less than 20 transfusions of RBCs;

Entity relations:
- Has_multiplier("transfusions of RBCs", "no less than 20")